發展遲緩應包括下列那些方面有異常或可預期會有發展遲緩之現象，需要接受早期療育？①認知發 展 ②語言及溝通發展 ③心理社會發展 ④動作發展
A. 僅①④
B. 僅①②④
C. 僅①③④
D. ①②③④

正確答案：D. ①②③④